Clinical trial exclusion criteria:
Other spinal pathology or other associated medical condition
Major neurologic developmental delay
Need for anterior surgery or for vertebral column resection.
Preoperative opioid use
Inability to use PCA

Annotated entities:
- Condition: "spinal pathology"
- Condition: "associated medical condition"
- Condition: "Major neurologic developmental delay"
- Procedure: "anterior surgery"
- Mood: "Need for"
- Procedure: "vertebral column resection"
- Temporal: "Preoperative"
- Drug: "opioid"
- Condition: "Inability to use"
- Procedure: "PCA"